Clinical trial inclusion criterion:
Patients must not have active local-regional disease prior to registration.

Entity relations:
- Has_temporal("local-regional disease", "active")
- Has_negation("local-regional disease", "not")